Clinical trial inclusion criterion:
Active AS assessed by total Bath Ankylosing Spondylitis Disease Activity index (BASDAI) = 4 (0-10) at baseline

Annotated entities:
- Condition: "AS"
- Qualifier: "Active"
- Measurement: "total Bath Ankylosing Spondylitis Disease Activity index (BASDAI)"
- Value: "= 4"
- Temporal: "at baseline"